Clinical trial inclusion criteria:
A positive history of chronic claudication,
Exercise-limiting claudication established by history and direct observation during a screening walking test administered by the evaluating vascular surgeon,
Arterial occlusive disease per ankle Brachial index measurements and/or other imaging modalities,
Stable blood pressure regimen, stable lipid regimen, stable diabetes regimen and risk factor control for 6 weeks.

Annotated entities:
- Temporal: "positive history"
- Condition: "chronic claudication"
- Condition: "Exercise-limiting claudication"
- Temporal: "history"
- Procedure: "direct observation"
- Procedure: "screening walking test"
- Condition: "Arterial occlusive disease"
- Procedure: "ankle Brachial index measurements"
- Procedure: "imaging modalities"
- Qualifier: "Stable"
- Procedure: "blood pressure regimen"
- Qualifier: "stable"
- Procedure: "lipid regimen"
- Qualifier: "stable"
- Procedure: "diabetes regimen"
- Procedure: "risk factor control"
- Multiplier: "for 6 weeks"